先天性幽門狹窄（pyloric stenosis）在何時最易出現腸壁蠕動波（visible peristalsis）？
A. 餵食前、嘔吐前
B. 餵食前、嘔吐後
C. 餵食後、嘔吐前
D. 餵食後、嘔吐後

正確答案：C. 餵食後、嘔吐前